Clinical trial inclusion criteria:
Type I diabetic patients
Parturients presented for Cesarean section

Annotated entities:
- Condition: "Type I diabetic"
- Condition: "Parturients"
- Measurement: "Cesarean section"